Clinical trial exclusion criterion:
Drug-eluting stent implantation within 3 months prior to TAVI procedure;

Annotated entities:
- Device: "Drug-eluting stent"
- Procedure: "implantation"
- Temporal: "within 3 months prior to TAVI procedure"
- Reference_point: "TAVI procedure"
- Procedure: "TAVI procedure"